一位65歲女性10年前停經後得到第一期乳癌，只以外科治療。最近發現蝕骨性骨骼病灶，證實為乳癌轉移ER+，HER2-negative，此外無其他臟器轉移，下列何者為最適當的治療？
A. 芳香環轉化酶抑制劑+雙磷酸鹽
B. 多種藥劑化學治療 +雙磷酸鹽
C. capecitabine +雙磷酸鹽
D. 單一藥劑化學治療 +strontium-89

正確答案：A. 芳香環轉化酶抑制劑+雙磷酸鹽